Clinical trial exclusion criterion:
Hunt Hess Grade 5 SAH

Entity relations:
- Has_value("Hunt Hess Grade", "5")
- AND("SAH", "Hunt Hess Grade")